BV positive by Nugent score

The above is a clinical trial inclusion criterion. Annotated with entity spans:
[Measurement: BV] [Value: positive] by [Measurement: Nugent score]